Clinical trial inclusion criterion:
Normal uterine cavity on ultrasound exam (e.g., no presence of hydrosalpinx)

Entity relations:
- Has_context("ultrasound exam", "Normal uterine cavity")
- Has_negation("hydrosalpinx", "no presence of")
- Subsumes("Normal uterine cavity", "hydrosalpinx")